Clinical trial inclusion criterion:
Patients with heart transplantation

Annotated entities:
- Procedure: "heart transplantation"